Clinical trial exclusion criterion:
Evidence of low ovarian reserve by at least one of the following: AMH = 1,5 ng/mL and/or basal CD 3 FSH = 10 mIU/mL and/or basal CD 3 Estradiol = 60 ng/mL and/or previous egg collection yield = 3 oocytes.

Entity relations:
- Has_value("AMH", "= 1,5 ng/mL")
- Has_value("basal CD 3 FSH", "= 10 mIU/mL")
- Has_value("basal CD 3 Estradiol", "= 60 ng/mL")
- Has_value("egg collection yield", "= 3 oocytes")
- Subsumes("low ovarian reserve", "AMH")
- OR("AMH", "basal CD 3 FSH", "basal CD 3 Estradiol", "egg collection yield")